Una disolución patrón primario en un valoración no debe:
1. Ser preparada a partir de un reactivo de alta pureza.
2. Tener una concentración exactamente conocida.
3. Mantener su composición con el tiempo.
4. Reaccionar de forma instantánea.
5. Dar lugar a reacciones secundarias.

Respuesta correcta: 5. Dar lugar a reacciones secundarias.